75歲男性，有高血壓及心房顫動多年，突發右側肢體偏癱與意識混沌而送至急診。至急診的時間為症狀發生後1小時，初步的腦部CT未顯示腦出血，下列何種狀況不適合使用靜脈血栓溶解藥物（tissue plasminogen activator, tPA）治療？
A. 一週前有短暫腦缺血發作
B. 血糖320 mg/dL
C. 使用warfarin，INR為1.3
D. 血壓200/120 mmHg

正確答案：D. 血壓200/120 mmHg